有關癲癇（epilepsy）的敘述，下列何者為非？
A. 在頭部外傷後急性期之抽搐發作（convulsive seizure）可以定義為癲癇
B. 在頭部外傷後慢性期之抽搐發作可以定義為癲癇
C. 癲癇的病患中，局部型發作（partial seizure）要比全身型發作（generalized seizure）的比率高
D. 癲癇病患中，約 20%至 25%為藥物控制不良（medical refractory），須考慮施行癲癇手術

正確答案：A. 在頭部外傷後急性期之抽搐發作（convulsive seizure）可以定義為癲癇